La arginosuccinasa:
1. En una enzima del ciclo del ácido cítrico.
2. Convierte arginina en lisina.
3. Se activa por el efector alostérico N-acetilglutamato.
4. Produce fumarato.
5. Es un aminoácido glucogénico.

Respuesta correcta: 4. Produce fumarato.